癌症細胞常有過度分裂繁殖之現象。治療癌症之藥物也常針對此特性。下列何種藥物可以抑制二氫葉酸還原酶（dihydrofolate reductase）？
A. methotrexate
B. 5-FU（5-fluorouracil）
C. cyclophosphamide
D. cisplatin

正確答案：A. methotrexate